Las excitotoxinas activan:
1. Receptores nicotínicos.
2. Receptores de GABAA
3. Receptores de glicina.
4. Receptores NMDA.
5. Canales de Na+ dependientes de voltaje.

Respuesta correcta: 4. Receptores NMDA.